Clinical trial exclusion criterion:
Have a life expectancy of less than three months

Annotated entities:
- Observation: "life expectancy"
- Value: "less than three months"